GIS score of at least 6.

The above is a clinical trial inclusion criterion. Annotated with entity spans:
[Measurement: GIS score] of [Value: at least 6].